Clinical trial inclusion criterion:
40-120 kg, inclusive

Annotated entities:
- Person: "kg"
- Value: "40-120"